Clinical trial exclusion criterion:
Recent cerebrovascular accident

Annotated entities:
- Temporal: "Recent"
- Condition: "cerebrovascular accident"